What monoclonal antibody drugs are used to treat late stage melanoma?

Dabrafenib, ipilimumab and vemurafenib are monoclonal antibodies that are used to treat late-stage melanoma.